那一種藥物臨床上最適用於治療心房心律不整及防止心肌梗塞之復發與突發性死亡？
A. verapamil
B. quinidine
C. propranolol
D. flecainide

正確答案：C. propranolol